Aumenta el volumen sistólico si:
1. Aumenta la poscarga.
2. Aumenta la precarga.
3. Se inhibe el simpático.
4. Disminuye el retorno venoso.
5. Aumenta la frecuencia cardíaca.

Respuesta correcta: 2. Aumenta la precarga.